Una enfermera ha detectado, en diferentes ocasiones, un problema real en los pacientes que atiende que no se corresponde con ninguno de los diagnósticos contenidos en la clasificación NANDA. La forma de proceder para que pueda ser incluido en la taxonomía es proponer una estructura que contenga como mínimo:
1. El problema. La etiología. Los signos y los síntomas.
2. El problema. La etiología. Los signos y los síntomas. Estudios de los casos y sus resultados.
3. El problema definido. Las etiologías más comunes y las posibles. Características mayores y menores que indican la existencia del problema. Al menos los resultados de un estudio experimental.
4. La Etiqueta. Definición. Características definitorias. Factores relacionados. Apoyo bibliográfico. Intervenciones y resultados apropiados.
5. La Etiqueta. Definición. Características definitorias. Factores relacionados. Factores de riesgo. Apoyo bibliográfico. Intervenciones y resultados apropiados.

Respuesta correcta: 4. La Etiqueta. Definición. Características definitorias. Factores relacionados. Apoyo bibliográfico. Intervenciones y resultados apropiados.